Rotator cuff tear patients undergoing arthroscopic rotator cuff tear

The above is a clinical trial inclusion criterion. Annotated with entity spans:
[Condition: Rotator cuff tear] patients undergoing [Procedure: arthroscopic rotator cuff tear]